Clinical trial inclusion criteria:
Diagnosis of sacroiliitis
Age 18 to 80 years old
Chronic low back pain
SI joint pathology is the predominant source of pain
Positive Fortin Finger Test (PMT)
Joint anatomy is identifiable using ultrasonography
Patient has no other comorbidities that contraindicate the procedure
Patient has attempted physical therapy and corticosteroid injections with local anesthetic -Previous injections of lidocaine and corticosteroid provided at least minor immediate relief
Patient must not have had a corticosteroid injection in the SI joint within the last three months
Patient must consent to the procedure

Annotated entities:
- Condition: "sacroiliitis"
- Person: "Age"
- Value: "18 to 80 years"
- Condition: "Chronic low back pain"
- Condition: "SI joint pathology"
- Non-representable: "is the predominant source of pain"
- Value: "Positive"
- Measurement: "Fortin Finger Test (PMT)"
- Non-representable: "Joint anatomy is identifiable using ultrasonography"
- Negation: "no"
- Qualifier: "other"
- Condition: "comorbidities that contraindicate the procedure"
- Procedure: "physical therapy"
- Procedure: "corticosteroid injections"
- Drug: "ocal anesthetic"
- Non-representable: "-Previous injections of lidocaine and corticosteroid provided at least minor immediate relief"
- Negation: "not"
- Procedure: "corticosteroid injection"
- Qualifier: "SI joint"
- Temporal: "within the last three months"
- Observation: "consent to the procedure"